Clinical trial exclusion criterion:
Serum Cr > 2.0 mg/dL

Annotated entities:
- Measurement: "Serum Cr"
- Value: "> 2.0 mg/dL"